Clinical trial exclusion criteria:
Previous randomization in this study
Treatment with IV antibiotics in the 6 weeks prior to Visit 1
Admission to the intensive care unit for current pulmonary exacerbation in the two weeks prior to Visit 2, unless admission was due to a desensitization protocol
Pneumothorax in the two weeks prior to Visit 2
Primary diagnosis for current hospitalization is unrelated to worsening lower respiratory symptoms (e.g., pulmonary clean out, distal intestinal obstruction syndrome (DIOS), sinusitis)
Massive hemoptysis defined as > 250 cc in a 24 hour period or 100 cc/day over 4 consecutive days occurring in the two weeks prior to Visit 2
Current pulmonary exacerbation thought to be due to allergic bronchopulmonary aspergillosis (ABPA)
At Visit 1, receiving ongoing treatment with a duration of more than 2 weeks with prednisone equivalent to >10mg/day
History of solid organ transplantation
Receiving antimicrobial therapy to treat non-tuberculous mycobacterium (e.g., M. abscessus, M. avium complex) in the two weeks prior to Visit 2

Annotated entities:
- Non-query-able: "Previous randomization in this study"
- Drug: "IV antibiotics"
- Temporal: "in the 6 weeks prior to Visit 1"
- Reference_point: "Visit 1"
- Observation: "Admission to the intensive care unit"
- Visit: "intensive care unit"
- Condition: "pulmonary exacerbation"
- Temporal: "in the two weeks prior to Visit 2"
- Reference_point: "Visit 2"
- Procedure: "desensitization protocol"
- Negation: "unless"
- Condition: "Pneumothorax"
- Temporal: "in the two weeks prior to Visit 2"
- Reference_point: "Visit 2"
- Condition: "Primary diagnosis"
- Observation: "current hospitalization"
- Negation: "unrelated"
- Condition: "lower respiratory symptoms"
- Qualifier: "worsening"
- Condition: "pulmonary clean out"
- Condition: "distal intestinal obstruction syndrome"
- Condition: "DIOS"
- Condition: "sinusitis"
- Condition: "hemoptysis"
- Qualifier: "Massive"
- Multiplier: "> 250 cc"
- Temporal: "in a 24 hour period"
- Multiplier: "100 cc/day"
- Temporal: "over 4 consecutive days"
- Temporal: "in the two weeks prior to Visit 2"
- Reference_point: "Visit 2"
- Condition: "pulmonary exacerbation"
- Condition: "allergic bronchopulmonary aspergillosis"
- Condition: "ABPA"
- Temporal: "At Visit 1 more than 2 weeks"
- Drug: "prednisone"
- Multiplier: ">10mg/day"
- Reference_point: "Visit 1"
- Condition: "solid organ transplantation"
- Drug: "antimicrobial therapy"
- Qualifier: "non-tuberculous mycobacterium"
- Qualifier: "M. abscessus"
- Qualifier: "M. avium complex"
- Temporal: "in the two weeks prior to Visit 2"
- Reference_point: "Visit 2"